Coronary or carotid artery disease likely to require surgical or percutaneous intervention within the 6 months.

The above is a clinical trial exclusion criterion. Annotated with entity spans:
[Condition: Coronary] or [Condition: carotid artery disease] [Mood: likely] to require [Procedure: surgical] or [Procedure: percutaneous intervention] [Temporal: within the 6 months].